Clinical trial exclusion criterion:
Radiotherapy within 4 weeks of trial entry.

Annotated entities:
- Procedure: "Radiotherapy"
- Temporal: "within 4 weeks of trial entry"
- Reference_point: "trial entry"